下列何者含有最少量基質（ground substance）？
A. 間葉組織（mesenchyme）
B. 黏液結締組織（mucous connective tissue） 	-
C. 規則緻密結締組織（dense regular connective tissue）
D. 不規則緻密結締組織（dense irregular connective tissue）

正確答案：C. 規則緻密結締組織（dense regular connective tissue）